Uncontrolled concurrent disease

The above is a clinical trial exclusion criterion. Annotated with entity spans:
[Qualifier: Uncontrolled] [Condition: concurrent disease]